Known allergy to local anesthetics (7) Not scheduled for closed reduction with percutaneous pinning under general anesthesia

The above is a clinical trial exclusion criterion. Annotated with entity spans:
Known [Condition: allergy] to [Drug: local anesthetics] (7) [Negation: Not] [Mood: scheduled for] [Procedure: closed reduction with percutaneous pinning] under [Procedure: general anesthesia]